Clinical trial exclusion criterion:
active bowel inflammation

Annotated entities:
- Temporal: "active"
- Condition: "bowel inflammation"